All patients referred to a participating research centre with suspicion of or confirmed endometrial cancer.

The above is a clinical trial inclusion criterion. Annotated with entity spans:
All patients referred to a [Visit: participating research centre] with [Mood: suspicion of] or [Qualifier: confirmed] [Condition: endometrial cancer].